4. Increased risk of bradycardia on investigator clinical judgment

The above is a clinical trial exclusion criterion. Annotated with entity spans:
[Parsing_Error: 4.] [Non-query-able: Increased risk] of [Condition: bradycardia] on [Subjective_judgement: investigator clinical judgment]